Clinical trial exclusion criterion:
Uncontrolled myocardial ischemia (repeated chest pain or dyspnea after revascularization)

Annotated entities:
- Condition: "myocardial ischemia"
- Qualifier: "Uncontrolled"
- Condition: "chest pain"
- Qualifier: "repeated"
- Condition: "dyspnea"
- Temporal: "after revascularization"
- Reference_point: "revascularization"
- Procedure: "revascularization"